Clinical trial inclusion criterion:
Present to ED primary for management of LBP, defined as pain originating between the lower border of the scapulae and the upper gluteal folds. Flank pain, that is pain originating from tissues lateral to the paraspinal muscles, will not be included.

Annotated entities:
- Visit: "ED"
- Condition: "LBP"
- Observation: "Present"
- Condition: "pain"
- Qualifier: "between the lower border of the scapulae and the upper gluteal folds"
- Condition: "Flank pain"
- Condition: "pain"
- Qualifier: "tissues lateral to the paraspinal muscles"
- Negation: "not"